Patients with known brain metastases, unless these metastases have been treated and/or have been stable for at least six months prior to study start. Subjects with a history of brain metastases must have a head CT with contrast to document either response or progression.

The above is a clinical trial exclusion criterion. Annotated with entity spans:
Patients with known [Condition: brain metastases], [Negation: unless] these metastases have been [Procedure: treated] and/or have [Qualifier: been stable for] [Temporal: at least six months prior to study start]. Subjects with a [Temporal: history of] [Condition: brain metastases] must have a [Procedure: head CT with contrast] to document either response or progression.